下列有關聽覺之敘述，何者錯誤？
A. 右耳之聽覺訊息可傳入兩側大腦皮質
B. 聽覺皮質主要位於大腦額葉
C. 腦幹可發出抑制性訊息抑制內耳聽覺接受器
D. Wernicke's area 屬於聽覺聯合皮質（auditory association cortex）

正確答案：B. 聽覺皮質主要位於大腦額葉